一位 35 歲男性因 2 小時前右踝關節突發性疼痛而入急診。病人表示 2 年前有過一次類似情況，發生在左膝關節，經醫師打止痛劑後就緩解，不知原因為何。今天晚上與同事去聚餐。吃完海鮮大餐與啤酒後半小時就開始疼痛。身體診查發現體溫為 37.3℃，右踝關節紅腫且有明顯壓痛。血中白血球為 14,500/mm3，下列何者最能幫助進一步的鑑別診斷？
A. 血中尿酸值
B. 關節液分析
C. 踝關節 X 光
D. CRP

正確答案：B. 關節液分析